Clinical trial exclusion criterion:
birth weight < 2500 g

Annotated entities:
- Measurement: "birth weight"
- Value: "< 2500 g"